Clinical trial exclusion criterion:
Patients with congenital anomalies, chromosomal anomalies, or heart defects.

Entity relations:
- OR("congenital anomalies", "chromosomal anomalies", "heart defects")